下列何種情形不會增加頸動脈搏（carotid pulse）的強度（intensity）？
A. 主動脈閉鎖不全
B. 左心房黏液瘤（myxoma）
C. 發燒
D. 貧血

正確答案：B. 左心房黏液瘤（myxoma）